下列何種電學診斷方法用於證實糖尿病神經病變（diabetic neuropathy），最具診斷價值？
A. 神經傳導（nerve conduction）檢查
B. 針肌電圖（needle electromyography）檢查
C. 感覺神經誘發電位（somato-sensory evoked potential）檢查
D. 連續電刺激神經（repetitive nerve stimulation）檢查

正確答案：A. 神經傳導（nerve conduction）檢查